陳小姐，45 歲，過去未曾懷孕或特殊疾病史，因下腹疼痛至門診就診，超音波發現一 7 公分骨盆腔複雜性腫瘤，手術中病理冷凍切片證實為亮細胞卵巢癌（clear cell adenocarcinoma of ovary），並發現腫瘤與一段小腸粘黏並有大腸侵犯，肝臟表面及橫膈膜下並沒有腫瘤轉移，有關患者的治療，下列何者正確？
A. 患者為第 IV 期卵巢癌患者
B. 應向家屬說明腫瘤已向外擴散，無法再做手術切除，只能靠術後化學治療
C. 患者應接受減積手術，可能需包括部分小腸及大腸切除，術後應接受化學治療
D. 患者需接受骨盆腔臟器剜除手術（包括膀胱、子宮及直腸全切除，人工肛門及人工膀胱手術）

正確答案：C. 患者應接受減積手術，可能需包括部分小腸及大腸切除，術後應接受化學治療